下列資料代表 6 個接受髖關節置換手術病人的住院天數（天）：4, 3, 3, 5, 4, 和 20，那一個集中趨勢統計量最適合描述此資料？
A. 平均值
B. 全距
C. 眾數
D. 中位數

正確答案：D. 中位數